What is the first line treatment for sarcoidosis?

Sarcoidosis is a systemic granulomatous disease that affects numerous organs, commonly manifesting at the lungs and skin. Corticosteroids remain the first line of treatment.